下列有關甲狀腺舌管囊腫（thyroglossal duct cyst）之敘述，何者錯誤？
A. 生長在頸部中央
B. 不會發生乳突癌
C. 有時會有細菌感染
D. 手術時要將舌骨中央切除

正確答案：B. 不會發生乳突癌